Clinical trial exclusion criterion:
any history of malnutrition before enrollment

Annotated entities:
- Condition: "malnutrition"
- Temporal: "before enrollment"